Clinical trial exclusion criterion:
History of life threatening asthma: Defined as an asthma episode that required intubation and/or was associated with hypercapnea, respiratory arrest or hypoxic seizures within the last 6 months.

Entity relations:
- Has_qualifier("asthma", "life threatening")
- multi("required intubation", "intubation")
- Has_qualifier("asthma episode", "required intubation")
- Has_temporal("hypercapnea", "within the last 6 months")
- AND("asthma episode", "hypercapnea")
- Subsumes("asthma", "asthma episode")
- OR("hypercapnea", "respiratory arrest", "hypoxic seizures")